Clinical trial exclusion criterion:
use of immunosuppressive drugs, corticosteroids or anorexigen

Entity relations:
- OR("immunosuppressive drugs", "corticosteroids", "anorexigen")